Clinical trial exclusion criterion:
(relative) Contraindications for FA or ICGA;

Annotated entities:
- Condition: "Contraindications"
- Procedure: "FA"
- Procedure: "ICGA"